Clinical trial exclusion criterion:
History of previous open-laparotomy.

Annotated entities:
- Procedure: "open-laparotomy"
- Temporal: "previous"
- Temporal: "History"